Clinical trial exclusion criterion:
Presence of hearing loss

Annotated entities:
- Condition: "hearing loss"